Clinical trial exclusion criteria:
don't have Diabetes and abnormal metabolism of sugar
not noticed as bipolar disorder
have an organic brain disease
pregnant or breastfeeding women
don't have heart disease
have actively suicidal thought(Suicidal ideation score of MADRS is 6)
who are judged by the investigator to should be excluded from the study

Annotated entities:
- Negation: "don't have"
- Condition: "Diabetes"
- Condition: "abnormal metabolism of sugar"
- Negation: "not"
- Mood: "noticed"
- Condition: "bipolar disorder"
- Condition: "organic brain disease"
- Condition: "pregnant"
- Observation: "breastfeeding"
- Person: "women"
- Negation: "don't have"
- Condition: "heart disease"
- Condition: "actively suicidal thought"
- Measurement: "Suicidal ideation score of MADRS"
- Value: "6"
- Observation: "judged by the investigator to should be excluded from the study"